嬰幼兒常呼吸道感染，嘴唇發紺，於左前胸能聽到收縮期 3/6 度之心雜音，並有心臟衰竭，心電圖呈現 QRS 心軸正 240 度，右心室肥厚；超音波心圖又有嚴重之二尖瓣膜閉鎖不全。則此時最可能之先天性心臟病為：
A. 大的心室中隔缺損
B. 大的開放性動脈導管
C. 心房心室中隔缺損（atrioventricular septal defect）
D. 全肺靜脈迴流異常（total anomalous pulmonary venous return）

正確答案：C. 心房心室中隔缺損（atrioventricular septal defect）